Clinical trial inclusion criterion:
Patient is able to read understand and singe an inform consent.

Annotated entities:
- Observation: "able to read"
- Observation: "understand"
- Observation: "singe"